List scaffold proteins of the ERK signaling pathway.

kinase suppressor of Ras 1
MEK Partner 1
Beta-arrestin
IQ motif containing GTPase-activating protein 1
kinase suppressor of Ras 2
mitogen-activated protein kinase organizer 1